Señale la opción correcta:
1. Los broncodilatadores de acción prolongada deben utilizarse a demanda.
2. Los broncodilatadores de acción rápida deben administrarse cada 3-5 horas.
3. La bradicardia es un efecto adverso que aparece con frecuencia tras la administración de broncodilatadores.
4. Los glucocorticoides se utilizan como tratamiento preventivo de las crisis en pacientes asmáticos.
5. Las respuestas 1 y 4 son correctas.

Respuesta correcta: 4. Los glucocorticoides se utilizan como tratamiento preventivo de las crisis en pacientes asmáticos.